Clinical trial exclusion criterion:
no confirmation of the gestational age

Annotated entities:
- Negation: "no"
- Measurement: "gestational age"